Clinical trial inclusion criterion:
Males and females aged 18-40 years of age at the time of vaccination in good health as determined by medical history, physical exam, laboratory assessments and the clinical judgment of the Principal Investigator

Annotated entities:
- Person: "Males"
- Person: "females"
- Person: "aged"
- Value: "18-40 years"
- Person: "age"
- Temporal: "at the time of vaccination"
- Reference_point: "time of vaccination"
- Condition: "good health"
- Undefined_semantics: "good health"
- Temporal: "medical history"
- Procedure: "physical exam"
- Procedure: "laboratory assessments"
- Subjective_judgement: "the clinical judgment of the Principal Investigator"